liver transplant

The above is a clinical trial inclusion criterion. Annotated with entity spans:
[Procedure: liver transplant]